Clinical trial inclusion criterion:
18-85 years of age, inclusive

Annotated entities:
- Person: "age"
- Value: "18-85 years"